一位 59 歲糖尿病病人，其上臂腳踝血壓比（ankle-brachial index）為 0.48，被轉介至復健科做心肺測試，其結果最不可能是：
A. 最大攝氧量（peak VO2	）正常
B. 血壓異常上升
C. 無氧閾值（anaerobic threshold）下降
D. 未達年齡預期最大心跳率（age-predicted maximal heart rate）

正確答案：A. 最大攝氧量（peak VO2	）正常